Clinical trial inclusion criteria:
Patients with osteoarthritis of the hip secondary to degeneration, inflammatory arthritis, gouty arthritis, acetabular dysplasia or osteonecrosis of the femoral head, and undergoing primary unilateral minimally invasive THA
Age > 18 years and < 90 years
Failure of medical treatment or rehabilitation.
Hemoglobin > 11g/dl,
No use of non-steroid anti-inflammatory agent one week before operation

Annotated entities:
- Condition: "osteoarthritis"
- Qualifier: "hip"
- Qualifier: "secondary to degeneration"
- Condition: "degeneration"
- Condition: "inflammatory arthritis"
- Condition: "gouty arthritis"
- Condition: "acetabular dysplasia"
- Condition: "osteonecrosis"
- Qualifier: "femoral head"
- Temporal: "undergoing"
- Qualifier: "primary"
- Qualifier: "unilateral"
- Procedure: "minimally invasive THA"
- Person: "Age"
- Value: "> 18 years"
- Value: "< 90 years"
- Qualifier: "Failure"
- Procedure: "medical treatment"
- Procedure: "rehabilitation"
- Measurement: "Hemoglobin"
- Value: "> 11g/dl"
- Drug: "non-steroid anti-inflammatory agent"
- Temporal: "one week before operation"
- Reference_point: "operation"
- Negation: "No"